Pathologically diagnosed with advanced gastric cancer (including adenocarcinoma of the gastroesophageal junction) with measurable metastases outside the stomach (measuring = 10mm on spiral CT scan, satisfying the criteria in RECIST 1.1);

The above is a clinical trial inclusion criterion. Annotated with entity spans:
Pathologically diagnosed with [Condition: advanced gastric cancer] (including [Condition: adenocarcinoma] of the [Qualifier: gastroesophageal junction]) with measurable [Condition: metastases] [Negation: outside] the [Qualifier: stomach] (measuring = 10mm on spiral CT scan, satisfying the criteria in RECIST 1.1);